any current (or within past 2 months) medical condition requiring medication that would interact with dronabinol or interfere with the study protocol

The above is a clinical trial exclusion criterion. Annotated with entity spans:
any [Temporal: current] (or [Temporal: within past 2 months]) [Condition: medical condition] requiring [Drug: medication] that [Mood: would interact with] [Drug: dronabinol] or [Mood: interfere with the study protocol]